Life-expectancy > 6 months.

The above is a clinical trial inclusion criterion. Annotated with entity spans:
[Observation: Life-expectancy] [Value: > 6 months].